Clinical trial exclusion criterion:
Pregnant or lactating women

Annotated entities:
- Pregnancy_considerations: "Pregnant or lactating women"